Subject's ability to lay in a supine position with their hands at their sides during CVP measurements

The above is a clinical trial inclusion criterion. Annotated with entity spans:
Subject's [Observation: ability to lay in a supine position with their hands at their sides] [Temporal: during CVP measurements]